Durante el proceso de intercambio en los capilares, la fuerza activa neta que atrae líquido del espacio intersticial de nuevo hacia los capilares es:
1. Gravedad.
2. Presión osmótica del líquido intersticial.
3. Presión osmótica coloidal del plasma.
4. Presión sanguínea hidrostática.
5. Presión hidrostática glomerular.

Respuesta correcta: 3. Presión osmótica coloidal del plasma.